Clinical trial exclusion criterion:
TPED > 135° (Tubiana stage 4) in finger to be treated

Entity relations:
- Has_value("TPED", "> 135°")
- Has_value("Tubiana", "stage 4")
- Subsumes("TPED", "Tubiana")
- Has_qualifier("TPED", "finger to be treated")